Diagnosed with spinal cord injury between 3 days and 4 weeks

The above is a clinical trial inclusion criterion. Annotated with entity spans:
Diagnosed with [Condition: spinal cord injury] [Temporal: between 3 days and 4 weeks]